Clinical trial exclusion criterion:
Pregnancy or breastfeeding, or expecting to conceive while in study;

Annotated entities:
- Pregnancy_considerations: "Pregnancy or breastfeeding, or expecting to conceive while in study"